Clinical trial inclusion criterion:
Male or female children between the ages of 10 and 35 years with congenital heart disease that has been palliated with a Fontan circulation.

Entity relations:
- Has_value("ages", "between 10 and 35 years")
- AND("congenital heart disease", "Fontan circulation")
- OR("Male", "female")